Hemoglobin > 11g/dl,

The above is a clinical trial inclusion criterion. Annotated with entity spans:
[Measurement: Hemoglobin] [Value: > 11g/dl],